Presence of clinical contraindications for treatment with MTX

The above is a clinical trial exclusion criterion. Annotated with entity spans:
[Undefined_semantics: Presence of clinical contraindications for treatment with MTX]